關於運動和血糖的關係，下列敘述何者錯誤？
A. 運動可以協助糖尿病患者血糖的控制
B. 運動不能促進第II型糖尿病患者的胰島素敏感度
C. 第Ｉ型糖尿病患者，在運動時容易有低血糖之危險
D. 對血糖耐受性差之患者，規律運動加上飲食控制，可以降低此類患者變成第II型糖尿病之危險性

正確答案：B. 運動不能促進第II型糖尿病患者的胰島素敏感度